Subjects were not to have participated in a previous clinical trial within 90 days prior to study initiation.

The above is a clinical trial exclusion criterion. Annotated with entity spans:
[Context_Error: Subjects were not to have participated in a previous clinical trial within 90 days prior to study initiation.]